Las vellosidades intestinales:
1. Se extienden a lo largo de todo el intestino.
2. No están en el intestino grueso.
3. Son visibles únicamente al microscopio electrónico.
4. Contienen únicamente células absorbentes.
5. Carecen de vasos en su lámina propia.

Respuesta correcta: 2. No están en el intestino grueso.